最常出現於 von Hippel-Lindau disease 的腦瘤為下列何者？
A. 多形性膠質母細胞瘤（Glioblastoma multiforme）
B. 血管母細胞瘤（Hemangioblastoma）
C. 泌乳激素瘤（Prolactinoma）
D. 星狀細胞瘤（Astrocytoma）

正確答案：B. 血管母細胞瘤（Hemangioblastoma）